下列四項診斷中，那一種個案首次發作時，最常自行前往急診就醫？
A. 急性精神分裂症
B. 恐慌症
C. 身體形象畏懼症（body dysmorphic disorder）
D. 慮病症（hypochondriasis）

正確答案：B. 恐慌症